Clinical trial exclusion criterion:
Subjects with a history of difficulty in providing blood samples

Annotated entities:
- Temporal: "history"
- Observation: "difficulty in providing blood samples"